Clinical trial inclusion criterion:
between 18 and 75 years old

Entity relations:
- Has_value("old", "between 18 and 75 years")